Refusal

The above is a clinical trial exclusion criterion. Annotated with entity spans:
[Non-query-able: Refusal]